History of kidney transplant

The above is a clinical trial exclusion criterion. Annotated with entity spans:
[Temporal: History] of [Procedure: kidney transplant]